Clinical trial inclusion criterion:
Visual analog score pain >= 5

Entity relations:
- Has_value("Visual analog score pain", ">= 5")